下列那一個因子必須在血管內皮細胞與其受器（receptor）結合，活化蛋白質 C 以減低凝血效應？
A. 凝血酶（thrombin）
B. 血漿素（plasmin）
C. 肝素（heparin）
D. 維生素 K

正確答案：A. 凝血酶（thrombin）